Which key gene is involved in syndromic obesity phenotype of patients with 1p21.3 microdeletions?

The MIR137 gene. It is the one that is responsible for the obesity phenotype of patients with 1p21.3 microdeletions.